High risk patients: General Surgery AKI Risk Index Class III, IV or V

The above is a clinical trial inclusion criterion. Annotated with entity spans:
[Condition: High risk] patients: [Measurement: General Surgery AKI Risk Index] [Value: Class III, IV or V]